腹腔子宮外孕手術時，如果供應胎盤血流的血管不能分辨時應作下列何種處置？
A. 將胎盤附著之腸子或腸繫膜切除
B. 馬上做動脈血管栓塞
C. 將胎盤留置腹腔內並監視胎盤的變化
D. 將胎盤留置腹腔內並給予 methotrexate

正確答案：C. 將胎盤留置腹腔內並監視胎盤的變化